What is the most probable defect underlying triple negative breast cancer?

The most probable defect underlying triple negative breast cancer is BRCA1 dysfunction.